Clinical trial inclusion criterion:
30 min or more of (1) continuous clinical seizure activities or (2) recurrent seizure activities without recovery(returning to baseline)between seizures;

Annotated entities:
- Multiplier: "30 min or more"
- Condition: "seizure"
- Condition: "seizure"
- Temporal: "continuous"
- Temporal: "recurrent"
- Qualifier: "without recovery"